Clinical trial inclusion criterion:
Subjects who take atypical antipsychotic drugs, and should be maintained on current antipsychotic drugs (including atypical antipsychotic drugs) and dose for at least 4 weeks prior to the screening.

Annotated entities:
- Drug: "atypical antipsychotic drugs"
- Non-representable: "and should be maintained on current antipsychotic drugs (including atypical antipsychotic drugs) and dose for at least 4 weeks prior to the screening"